Clinical trial inclusion criterion:
unprotected sex (in past 6 months) with 1 or more men of unknown HIV status

Annotated entities:
- Observation: "unprotected sex"
- Temporal: "in past 6 months"
- Multiplier: "1 or more"
- Person: "men of unknown HIV status"